Clinical trial exclusion criterion:
Patients with clinical signs of raised ICP.

Annotated entities:
- Measurement: "ICP"
- Value: "raised"